What 3 disorders are commonly associated with Kaufman-McKusick syndrome?

MKKS) is one of rare syndromes which presents as polydactyly, hydrometrocolpos (HMC) and cardiac anomalies.